What treatment was studied in the KEYNOTE-522 trial?

KEYNOTE-522 trial studied adjuvant pembrolizumab for patients with triple-negative breast cancer.